Clinical trial exclusion criterion:
2. Enhanced risk from lumbar puncture, including documented or suspected cerebral mass lesion predisposing to brain herniation or bleeding diathesis.

Annotated entities:
- Procedure: "lumbar puncture"
- Mood: "Enhanced risk"
- Condition: "cerebral mass lesion"
- Qualifier: "predisposing to brain herniation or bleeding diathesis"
- Mood: "predisposing to"
- Condition: "brain herniation"
- Condition: "bleeding diathesis"
- Mood: "documented"
- Mood: "suspected"